Clinical trial inclusion criterion:
Serum bicarbonate <15 mmol/L

Entity relations:
- Has_value("Serum bicarbonate", "<15 mmol/L")